Clinical trial exclusion criterion:
Chronic alcohol abuse

Entity relations:
- Has_multiplier("alcohol abuse", "Chronic")